Clinical trial exclusion criterion:
Patients with trauma within 6 months pre-operative.

Annotated entities:
- Procedure: "trauma"
- Temporal: "within 6 months pre-operative"
- Reference_point: "pre-operative"
- Procedure: "operative"